下列那一種黴菌不屬於擔子菌綱（Basidiomycetes）？
A. Cryptococcus
B. Trichosporon
C. Aspergillus
D. Malassezia

正確答案：C. Aspergillus